Clinical trial exclusion criterion:
heavy smokers (with a daily consumption >20 cigarettes)

Annotated entities:
- Qualifier: "heavy"
- Person: "smokers"
- Observation: "cigarettes"
- Multiplier: "daily consumption >20"